下列何種肺癌屬於神經內分泌細胞腫瘤？
A. 腺癌
B. 鱗狀上皮細胞癌
C. 小細胞癌
D. 大細胞癌

正確答案：C. 小細胞癌